Clinical trial exclusion criterion:
Subjects who can't comply with the appointments or with every protocol requirement.

Annotated entities:
- Non-query-able: "Subjects who can't comply with the appointments or with every protocol requirement."